El etopósido se utiliza en terapéutica por sus propiedades:
1. Antiagregantes plaquetarias.
2. Antianginosas.
3. Antineoplásicas.
4. Citostáticas.

Respuesta correcta: 3. Antineoplásicas.